Clinical trial inclusion criterion:
Provision of informed consent

Annotated entities:
- Informed_consent: "Provision of informed consent"